Clinically diagnosed Cushing's disease, acromegaly, gigantism

The above is a clinical trial exclusion criterion. Annotated with entity spans:
[Qualifier: Clinically diagnosed] [Condition: Cushing's disease], [Condition: acromegaly], [Condition: gigantism]